Clinical trial exclusion criterion:
History of anti-vascular endothelial growth factor treatment in the past 12 months

Entity relations:
- Has_temporal("anti-vascular endothelial growth factor", "in the past 12 months")